What can we measure with the TSA-Seq method?

mean chromosomal distances